胸腔復健的治療方法中，下列何者的主要目的不是用於痰液排除？
A. 背部扣擊（chest percussion）
B. 有效的咳嗽（effective cough）
C. 姿勢性引流（postural drainage）
D. 橫膈呼吸（diaphragmatic breathing）

正確答案：D. 橫膈呼吸（diaphragmatic breathing）